Weight-loss of >5kg in the preceding 6 months

The above is a clinical trial exclusion criterion. Annotated with entity spans:
[Observation: Weight-loss] of [Value: >5kg] in the [Temporal: preceding 6 months]